Clinical trial exclusion criterion:
12. Severe/untreated blood pressure (systolic 180 mm Hg, diastolic 95 mm Hg).

Annotated entities:
- Parsing_Error: "12."
- Context_Error: "blood pressure"
- Measurement: "systolic"
- Measurement: "diastolic"
- Value: "180 mm Hg"
- Value: "95 mm Hg"
- Measurement: "blood pressure"
- Qualifier: "Severe"
- Qualifier: "untreated"